chronic pancreatitis or pancreatic cancer

The above is a clinical trial exclusion criterion. Annotated with entity spans:
[Condition: chronic pancreatitis] or [Condition: pancreatic cancer]